Already on medications that may affect thyroid function (L-T4, carbimazole, propylthiouracil, amiodarone, lithium).

The above is a clinical trial exclusion criterion. Annotated with entity spans:
Already on [Drug: medications] that may [Value: affect] [Measurement: thyroid function] ([Drug: L-T4], [Drug: carbimazole], [Drug: propylthiouracil], [Drug: amiodarone], [Drug: lithium]).